Clinical trial exclusion criterion:
Woman of child-bearing potential not taking adequate contraception deemed reliable by the investigator.

Entity relations:
- Has_qualifier("contraception", "adequate")
- Has_negation("contraception", "not")
- AND("Woman", "contraception")
- Has_qualifier("contraception", "deemed reliable by the investigator")